What conditions are diagnosed using the scratch collapse test?

Evaluation of the Scratch Collapse Test for Carpal and Cubital Tunnel Syndrome-A Prospective, Blinded Study.